Clinical trial exclusion criterion:
Traumatic pulmonary contusion or laceration

Annotated entities:
- Condition: "pulmonary contusion"
- Condition: "laceration"
- Qualifier: "Traumatic"